Clinical trial inclusion criterion:
Age 60-80 years

Annotated entities:
- Person: "Age"
- Value: "60-80 years"